Clinical trial exclusion criterion:
Physician discretion

Annotated entities:
- Non-query-able: "Physician discretion"